下列何者在小腿沒有血管伴行？
A. 腓腸神經（sural nerve）
B. 腓深神經（deep peroneal nerve）
C. 腓淺神經（superficial peroneal nerve）
D. 脛神經（tibial nerve）

正確答案：C. 腓淺神經（superficial peroneal nerve）